El nitrógeno:
1. Es un gas sumamente reactivo a temperatura ambiente.
2. Las moléculas de nitrógeno están constituidas por dos átomos unidos entre sí por un enlace sencillo.
3. Presenta una reactividad superior a la de otras moléculas isoelectrónicas como el CO, el CNo el NO+.
4. A suficiente temperatura reacciona con el H2 para dar NH3.
5. Apenas forma compuestos binarios con el resto de elementos de la Tabla Periódica.

Respuesta correcta: 4. A suficiente temperatura reacciona con el H2 para dar NH3.